Clinical trial inclusion criterion:
Anti-mullerian hormone (AMH) greater than (>) 1.1 nanogram per milliliter (ng/mL)

Annotated entities:
- Measurement: "Anti-mullerian hormone (AMH)"
- Value: "greater than (>) 1.1 nanogram per milliliter (ng/mL)"